Donor is sero-positive in HBV/HCV/HIV or RPR.

The above is a clinical trial exclusion criterion. Annotated with entity spans:
Donor is [Condition: sero-positive in] HBV/HCV/HIV or RPR.